以異位性皮膚炎和經常性感染為臨床表現，並且合併有血小板降低的免疫不全症候群為：
A. Wiskott-Aldrich syndrome
B. X-linked agammaglobulinemia
C. Hyper-IgE syndrome
D. Netherton syndrome

正確答案：A. Wiskott-Aldrich syndrome